下列何者位於儲精囊內側？
A. 膀胱
B. 直腸
C. 前列腺
D. 輸精管

正確答案：D. 輸精管